Clinical trial exclusion criterion:
History of acute coronary syndrome in the past 30 days.

Annotated entities:
- Condition: "acute coronary syndrome"
- Temporal: "in the past 30 days"